En pacientes con insuficiencia cardíaca congestiva digitalizados, al administrar un diurético, éste debe ser necesariamente:
1. Un diurético del asa o de alto techo.
2. Una tiazida.
3. Un diurético osmótico.
4. Un diurético ahorrador de potasio.
5. Un diurético inhibidor de la anhidrasa carbónica.

Respuesta correcta: 4. Un diurético ahorrador de potasio.